Clinical trial exclusion criterion:
Use of PPI or NSAID in the past 4 weeks

Annotated entities:
- Drug: "PPI"
- Drug: "NSAID"
- Temporal: "in the past 4 weeks"